Clinical trial exclusion criterion:
Contra-indications to non-steroidal anti-inflammatory drugs: 1) history of hypersensitivity to NSAIDs or aspirin 2) active or history of peptic ulcer disease, chronic dyspepsia, or active or history of gastrointestinal bleed 3) Severe heart failure (NYHA 2 or worse) 4) hypertension (JNC7 stage 2 or worse) 5) Chronic kidney disease 3 or worse 6) Current use of anti-coagulants 7) Hepatitis 8) Alcoholism

Annotated entities:
- Condition: "Contra-indications"
- Drug: "non-steroidal anti-inflammatory drugs"
- Condition: "hypersensitivity"
- Drug: "NSAIDs"
- Drug: "aspirin"
- Temporal: "history"
- Temporal: "active"
- Temporal: "history"
- Condition: "peptic ulcer disease"
- Condition: "chronic dyspepsia"
- Temporal: "active"
- Temporal: "history"
- Condition: "gastrointestinal bleed"
- Qualifier: "Severe"
- Condition: "heart failure"
- Measurement: "NYHA"
- Value: "2 or worse"
- Condition: "hypertension"
- Measurement: "JNC7 stage"
- Value: "2 or worse"
- Condition: "Chronic kidney disease"
- Temporal: "Current"
- Drug: "anti-coagulants"
- Condition: "Hepatitis"
- Condition: "Alcoholism"